Clinical trial inclusion criteria:
Recipient is Age = 18 years
Met MGH transplant center criteria, listed for liver transplant
HCV naive
Able to sign informed consent

Annotated entities:
- Person: "Age"
- Value: "= 18 years"
- Qualifier: "MGH transplant center criteria"
- Procedure: "liver transplant"
- Measurement: "HCV"
- Value: "naive"
- Condition: "HCV naive"
- Observation: "Able to sign informed consent"